嚴重急性呼吸道症候群（SARS）是由冠狀病毒（Coronavirus）感染造成，其基因體為：
A. 雙股 RNA
B. 雙股 DNA
C. 正（＋）股 RNA
D. 負（－）股 RNA

正確答案：C. 正（＋）股 RNA